Clinical trial exclusion criterion:
1. Prior Therapy Exposure to chemotherapy or radiotherapy within 2 weeks prior to entering the study or those who have not recovered from adverse events due to agents administered more than 2 weeks earlier. Systemic steroids that have not been stabilized (≥ 5 days) to the equivalent of ≤10 mg/day prednisone prior to the start of the study drugs. No other investigational agents are allowed.

Annotated entities:
- Parsing_Error: "1."
- Temporal: "Prior"
- Procedure: "chemotherapy"
- Procedure: "radiotherapy"
- Temporal: "within 2 weeks prior"
- Reference_point: "entering the study"
- Condition: "recovered"
- Negation: "not"
- Condition: "adverse events"
- c-Requires_causality: "due to"
- Drug: "agents"
- Temporal: "more than 2 weeks earlier"
- Drug: "Systemic steroids"
- Qualifier: "stabilized"
- Negation: "not"
- Temporal: "≥ 5 days"
- Multiplier: "≤10 mg/day"
- Drug: "prednisone"
- Temporal: "prior to"
- Reference_point: "start of the study drugs"
- Drug: "other investigational agents"
- Grammar_Error: "No other investigational agents are allowed"
- Context_Error: "other investigational agents"